Clinical trial exclusion criterion:
acute narrow angle glaucoma

Annotated entities:
- Qualifier: "acute"
- Condition: "narrow angle glaucoma"